Active hemorrhage or increased risk of bleeding due to impairment of homeostasis.

The above is a clinical trial exclusion criterion. Annotated with entity spans:
[Condition: Active hemorrhage] or [Qualifier: increased] [Observation: risk of bleeding] due to [Condition: impairment of homeostasis].